Malabsorptive GI disease, such as celiac disease, or gastric bypass

The above is a clinical trial exclusion criterion. Annotated with entity spans:
[Condition: Malabsorptive GI disease], such as [Condition: celiac disease], or [Procedure: gastric bypass]